Clinical trial exclusion criterion:
Rheumatoid arthritis.

Annotated entities:
- Condition: "Rheumatoid arthritis"